Clinical trial inclusion criterion:
Subjects admitted to the hospital with acute or chronic medical illnesses or for elective and emergency surgical illness or trauma

Annotated entities:
- Observation: "admitted to the hospital"
- Condition: "medical illnesses"
- Qualifier: "chronic"
- Qualifier: "acute"
- Condition: "surgical illness"
- Condition: "trauma"
- Qualifier: "emergency"
- Qualifier: "elective"
- Grammar_Error: "and"